Clinical trial exclusion criterion:
Anticoagulant treatment after the operation (e.g. warfarin, direct thrombin inhibitors (dabigatran), FXa inhibitors (rivaroxaban, apixaban, heparin, low-molecular weight heparin, fondaparinux)

Annotated entities:
- Procedure: "Anticoagulant treatment"
- Temporal: "after the operation"
- Reference_point: "the operation"
- Procedure: "operation"
- Drug: "warfarin"
- Drug: "direct thrombin inhibitors"
- Drug: "dabigatran"
- Drug: "FXa inhibitors"
- Drug: "rivaroxaban"
- Drug: "apixaban"
- Drug: "heparin"
- Drug: "low-molecular weight heparin"
- Drug: "fondaparinux"